Patients with a prior serious hypersensitivity reaction to liraglutide

The above is a clinical trial exclusion criterion. Annotated with entity spans:
Patients with a [Temporal: prior] [Qualifier: serious] [Condition: hypersensitivity reaction] to [Drug: liraglutide]